下列何者為小腸黏膜區（mucosa）的 M 細胞之主要功能？
A. 分泌 IgA
B. 分泌黏液（mucus）
C. 使腸道（lumen）中之抗原進入組織
D. 使組織中之抗原進入腸道

正確答案：C. 使腸道（lumen）中之抗原進入組織